3. Total bilirubin > 2 × ULN

The above is a clinical trial exclusion criterion. Annotated with entity spans:
[Parsing_Error: 3.] [Measurement: Total bilirubin] [Value: > 2 × ULN]